有關第一型子宮內膜癌（type I endometrial cancer）之敘述，下列何者最不適當？
A. 常與雌激素過度刺激有關
B. 病人多為停經前後（perimenopausal）的女性
C. 病理形態多為 low grade endometrioid type
D. 預後通常比第二型子宮內膜癌差

正確答案：D. 預後通常比第二型子宮內膜癌差